給予妊娠婦女低劑量的 aspirin，會造成下列何種生理變化？
A. 減少 thromboxane
B. 增加 prostacyclin
C. 增加 prostaglandin E2
D. 增加 prostaglandin F

正確答案：A. 減少 thromboxane